Systematical inflammation

The above is a clinical trial exclusion criterion. Annotated with entity spans:
[Condition: Systematical inflammation]